Clinical trial exclusion criterion:
Presence of major contraindications to magnetic resonance imaging (cardiac pacemakers, claustrophobia, foreign bodies and implanted medical devices with ferromagnetic properties).

Entity relations:
- AND("major contraindications", "magnetic resonance imaging")
- Has_qualifier("implanted medical devices", "ferromagnetic properties")